Clinical trial exclusion criteria:
Pregnant women and young children aged <18 years;
Patients with underlying disease cases without the possibility of resuscitation (e.g., terminal cancer);
Patients with do-not-resuscitate (DNR) status;
Death by excessive bleeding (e.g., abdominal main artery rupture);
Patients who have experienced in-hospital CA;
Patients previously treated with steroid, anti-cancer medicine, or immunosuppression treatment before CA;
Patients already been registered with other studies; or
Patients from whom informed consent cannot be obtained

Annotated entities:
- Person: "women"
- Person: "young children"
- Person: "aged"
- Value: "<18 years"
- Condition: "terminal cancer"
- Condition: "underlying disease"
- Qualifier: "without the possibility of resuscitation"
- Observation: "do-not-resuscitate (DNR) status"
- Condition: "Death by excessive bleeding"
- Condition: "main artery rupture"
- Qualifier: "abdominal"
- Condition: "CA"
- Visit: "hospital"
- Qualifier: "in-hospital"
- Drug: "anti-cancer medicine"
- Drug: "steroid"
- Procedure: "immunosuppression treatment"
- Temporal: "before CA"
- Condition: "CA"
- Temporal: "previously"
- Procedure: "treated"
- Competing_trial: "Patients already been registered with other studies; or"
- Informed_consent: "Patients from whom informed consent cannot be obtained"